Clinical trial inclusion criterion:
immediate sub-pectoral prosthetic reconstruction;

Annotated entities:
- Procedure: "sub-pectoral prosthetic reconstruction"
- Qualifier: "immediate"